Clinical trial exclusion criterion:
6. Any serious, active infection (> Grade 2) at the time of treatment.

Entity relations:
- multi("> Grade 2", "> Grade 2")
- Has_qualifier("infection", "> Grade 2")
- Has_temporal("infection", "active")
- Has_qualifier("infection", "serious")